下列那一項工作不屬於塵肺症之危險族群？
A. 報社印刷工人暴露紙屑纖維
B. 噴砂工人暴露二氧化矽的粉塵
C. 耐火磚製造工人暴露石棉
D. 造船工人暴露石棉

正確答案：A. 報社印刷工人暴露紙屑纖維